Clinical trial exclusion criteria:
Relative contraindications to ECT therapy (recent MI or CVA, increased intracranial pressure, intracranial mass lesion, intracranial aneurysm, epilepsy, known cardiac arrhythmia, pheochromocytoma, pregnancy)
Contraindications to etomidate (sepsis, primary or secondary adrenal insufficiency, porphyria)
DSM-V diagnosis of a lifetime history of psychotic spectrum disorder
Drug or alcohol dependence, or abuse within the past 3 months, soy-bean oil allergy

Annotated entities:
- Condition: "Relative contraindications"
- Procedure: "ECT therapy"
- Temporal: "recent"
- Condition: "MI"
- Condition: "CVA"
- Value: "increased"
- Measurement: "intracranial pressure"
- Condition: "intracranial mass lesion"
- Condition: "intracranial aneurysm"
- Condition: "epilepsy"
- Condition: "cardiac arrhythmia"
- Condition: "pheochromocytoma"
- Condition: "pregnancy"
- Condition: "Contraindications"
- Drug: "etomidate"
- Condition: "sepsis"
- Qualifier: "primary"
- Qualifier: "secondary"
- Condition: "adrenal insufficiency"
- Condition: "porphyria"
- Qualifier: "DSM-V"
- Temporal: "lifetime history"
- Condition: "psychotic spectrum disorder"
- Condition: "Drug dependence"
- Condition: "alcohol dependence"
- Temporal: "within the past 3 months"
- Condition: "Drug abuse"
- Condition: "alcohol abuse"
- Condition: "soy-bean oil allergy"